下列那一個酵素位於粒線體電子傳遞鏈的 Complex IV？
A. NADH dehydrogenase
B. Cytochrome oxidase
C. Succinate dehydrogenase
D. Uniquinone:cytochrome c oxidoreductase

正確答案：B. Cytochrome oxidase